Clinical trial inclusion criteria:
currently on hemodialysis at a CDC dialysis unit
English speaking
able to provide informed consent

Annotated entities:
- Temporal: "currently"
- Procedure: "hemodialysis"
- Visit: "CDC dialysis unit"
- Observation: "English speaking"
- Informed_consent: "able to provide informed consent"